急診來一名左姆指掌指骨關節metacarpophalangeal joint完全截肢傷，該斷指可承受的warm ischemia time為：
A. 2小時
B. 4小時
C. 8小時
D. 12小時

正確答案：D. 12小時